Clinical trial exclusion criterion:
History of corneal ulcers or fungal infections

Annotated entities:
- Condition: "corneal ulcers"
- Condition: "fungal infections"
- Temporal: "History"